List drugs that were tested in the CheckMate 214 trial.

CheckMate 214 clinical trial compared Nivolumab plus Ipilimumab versus Sunitinib in Advanced Renal-Cell Carcinoma.